Absence of significant scarring in the pelvis from previous surgeries.

The above is a clinical trial inclusion criterion. Annotated with entity spans:
[Negation: Absence] of [Condition: significant scarring] in the [Qualifier: pelvis] [Qualifier: from previous surgeries].